下列藥物何者不適合使用於輕度持續性氣喘患者作為長期控制藥物？
A. 吸入型低劑量類固醇（corticosteroid）
B. 吸入型長效beta 2交感神經促進劑（long acting beta 2 agonist）
C. 吸入型cromolyn sodium
D. 口服緩釋型茶鹼（sustained release theophylline）

正確答案：B. 吸入型長效beta 2交感神經促進劑（long acting beta 2 agonist）